Clinical trial exclusion criterion:
Those subjects with previous use of vitamin D.

Annotated entities:
- Temporal: "previous use"
- Drug: "vitamin D"